下列何種NSAIDs藥物，可用於取代colchicine，作為第一線痛風的用藥？
A. Aspirin
B. Acetaminophen
C. Indomethacin
D. Ketorolac

正確答案：C. Indomethacin